Clinical trial exclusion criterion:
Vein diameter < 3mm

Entity relations:
- Has_value("Vein diameter", "< 3mm")